Able to provide voluntary, written informed consent with comprehension of all aspects of the protocol, prior to any study procedures.

The above is a clinical trial inclusion criterion. Annotated with entity spans:
[Post-eligibility: Able to provide voluntary, written informed consent with comprehension of all aspects of the protocol, prior to any study procedures.]